Patient does not meet inclusion criteria, discovered after randomization

The above is a clinical trial exclusion criterion. Annotated with entity spans:
[Post-eligibility: Patient does not meet inclusion criteria, discovered after randomization]